Clinical trial exclusion criterion:
History or current clinical evidence of moderate-to-severe fixed obstructive pulmonary disease or severe reactive airway diseases (e.g., asthma) requiring hospitalization within the past 2 years or patient currently using long-term inhaled bronchodilators

Annotated entities:
- Temporal: "History"
- Temporal: "current"
- Mood: "clinical evidence of"
- Qualifier: "moderate-to-severe"
- Qualifier: "fixed"
- Condition: "obstructive pulmonary disease"
- Qualifier: "severe"
- Condition: "reactive airway diseases"
- Condition: "asthma"
- Procedure: "hospitalization"
- Mood: "requiring"
- Temporal: "within the past 2 years"
- Temporal: "currently"
- Drug: "long-term inhaled bronchodilators"
- Reference_point: "the past 2 years"